Non-affective psychosis

The above is a clinical trial inclusion criterion. Annotated with entity spans:
[Condition: Non-affective psychosis]